Cardiac arrhythmia

The above is a clinical trial exclusion criterion. Annotated with entity spans:
[Condition: Cardiac arrhythmia]